Clinical trial inclusion criterion:
Treatment with stable doses of angiotensin-converting enzyme inhibitors, angiotensin II receptor blockers or anti-aldosterone agents in the last four weeks.

Annotated entities:
- Drug: "angiotensin-converting enzyme inhibitors"
- Multiplier: "stable doses"
- Drug: "angiotensin II receptor blockers"
- Drug: "anti-aldosterone agents"
- Temporal: "in the last four weeks"